關於癌症病人之疼痛治療，下列何者正確？
A. Morphine 劑量每日不得超過 200 mg 以防止呼吸抑制
B. 止痛劑之使用僅限於嚴重疼痛病患（severe pain）
C. Morphine 之最常見副作用為下痢（diarrhea）
D. 止痛劑使用應按時給藥（around the clock）

正確答案：D. 止痛劑使用應按時給藥（around the clock）